A la hora de elegir la intervención más adecuada, cuando se utilizan conjuntamente las clasificaciones de NANDA, NOC, y NIC, el elemento fundamental de referencia es:
1. El diagnóstico.
2. Las preferencias del paciente.
3. Los objetos del plan.
4. El resultado.
5. Las actividades que se pueden llevar a cabo.

Respuesta correcta: 4. El resultado.